Atendemos a un paciente que acaba de sufrir un accidente de tráfico. Se encuentra consciente y al tomarle las constantes tiene una presión arterial sistólica de 70 mmHg y una frecuencia cardiaca de 45 latidos/minuto. Además, la piel de las extremidades está caliente. ¿Cuál es la causa más probable del shock?
1. Shock hipovolémico.
2. Shock cardiogénico intrínseco.
3. Shock neurogénico.
4. Shock séptico.
5. Shock cardiogénico obstructivo.

Respuesta correcta: 3. Shock neurogénico.